Clinical trial exclusion criterion:
Allergy to local anesthetics

Entity relations:
- AND("Allergy", "local anesthetics")